Clinical trial inclusion criterion:
In the investigator's opinion, the subject still has significant intraretinal fluid with room for improvement in both macular edema and BCVA.

Annotated entities:
- Non-query-able: "In the investigator's opinion"
- Qualifier: "significant"
- Condition: "intraretinal fluid"
- Qualifier: "with room for improvement"
- Non-representable: "with room for improvement"
- Condition: "macular edema"
- Condition: "BCVA"